Clinical trial exclusion criterion:
Preoperative complete parenteral or enteral feeding

Entity relations:
- Has_temporal("complete enteral feeding", "Preoperative")
- OR("complete enteral feeding", "complete parenteral feeding")